Clinical trial exclusion criterion:
Unable to comprehend consent material because of language barrier or psychological difficulty

Annotated entities:
- Subjective_judgement: "Unable to comprehend consent material because of language barrier or psychological difficulty"